Los dos miembros de una pareja son ambos portadores de un gen recesivo para una determinada enfermedad. ¿Cuál es la probabilidad de tener un hijo enfermo?
1. 1.
2. 0,75.
3. 0,5.
4. 0,25.

Respuesta correcta: 4. 0,25.